Low risk: Gleason <or=6 & PSA <or=10 & Clinical Stage T1b-T2a,Nx or N0, Mx or M0

The above is a clinical trial inclusion criterion. Annotated with entity spans:
[Observation: Low risk]: [Measurement: Gleason] [Value: <or=6] & [Measurement: PSA] [Value: <or=10] & [Measurement: Clinical Stage] [Value: T1b-T2a],[Value: Nx] or [Value: N0], [Value: Mx] or [Value: M0]